王太太為61歲的家庭主婦，近幾個月來覺得手指僵硬、疼痛，但無麻木感。醫師診察發現她雙側的遠端指間關節及近端指間關節均有腫脹現象，有些關節合併有小硬塊，有些關節有壓痛感，請問王太太最可能的診斷 是下列何者？
A. 類風濕性關節炎
B. 痛風性關節炎
C. 退化性關節炎
D. 假痛風性關節炎

正確答案：C. 退化性關節炎